Clinical trial inclusion criterion:
Has an acceptable history of NSAID use

Annotated entities:
- Temporal: "history"
- Qualifier: "acceptable"
- Drug: "NSAID"